Clinical trial exclusion criterion:
Receiving antibiotic and/or probiotic, 8 weeks before the study

Entity relations:
- Has_index("8 weeks before the study", "the study")
- Has_temporal("antibiotic", "8 weeks before the study")
- OR("antibiotic", "probiotic")